Clinical trial exclusion criterion:
Poor personal hygiene

Annotated entities:
- Condition: "Poor personal hygiene"